3. A documented history of severe Symptomatic Orthostatic Hypotension (SOH) that, in the judgment of the treating physician, has required treatment with midodrine HCl , and has been at a stable dose for at least 3 months.

The above is a clinical trial inclusion criterion. Annotated with entity spans:
3. A documented history of [Qualifier: severe] [Condition: Symptomatic Orthostatic Hypotension (SOH)] that, in the judgment of the treating physician, has required treatment with [Drug: midodrine HCl] , and has been at a [Qualifier: stable dose] [Temporal: for at least 3 months].